Clinical trial exclusion criterion:
Cyclosporine; St. John's Wort; Efavirenz; Phenytoin; Carbamazepine; Bosentan; HIV protease inhibitors; modafinil; ketoconazole; or rifampin use within 7 days of enrollment

Annotated entities:
- Drug: "Cyclosporine"
- Drug: "St. John's Wort"
- Drug: "Efavirenz"
- Drug: "Phenytoin"
- Drug: "Carbamazepine"
- Drug: "Bosentan"
- Drug: "HIV protease inhibitors"
- Drug: "modafinil"
- Drug: "ketoconazole"
- Drug: "rifampin"
- Temporal: "within 7 days of enrollment"
- Reference_point: "enrollment"